人類免疫不全病毒（HIV）感染CD4+ T細胞，先與CD4接受器結合，再與副接受器（co-receptor）結合，副接受器也是一種趨化素接受器（chemokine receptor），下列何種副接受器若在open reading frame （ORF）上兩個對偶基因（allele）都有32鹼基對（base pair）缺失，則宿主不會感染HIV？
A. CCR2
B. CCR5
C. CXCR4
D. CXCR6

正確答案：B. CCR5